Idecabtagene vicleucel can be used for treatment of which disease?

Idecabtagene vicleucel was shown to be effective for Relapsed and Refractory Multiple Myeloma.